Clinical trial exclusion criterion:
Contraindications to placement of a Foley catheter in the bladder.

Entity relations:
- Has_qualifier("placement of a Foley catheter", "bladder")
- AND("Contraindications", "placement of a Foley catheter")